Clinical trial exclusion criteria:
Diagnosis of ankle fracture or ligament rupture
Has planned release from the Canadian Armed Forces within one year;
Documented restrictions on military duties
Has known intolerance or documented adverse reaction to acetaminophen or naproxen or celecoxib
Documented history of liver or kidney problems
pregnant or breastfeeding

Annotated entities:
- Condition: "ankle fracture"
- Condition: "ligament rupture"
- Observation: "release from the Canadian Armed Forces"
- Temporal: "within one year"
- Observation: "restrictions on military duties"
- Drug: "acetaminophen"
- Drug: "naproxen"
- Drug: "celecoxib"
- Condition: "adverse reaction"
- Condition: "intolerance"
- Condition: "kidney problems"
- Condition: "liver problems"
- Temporal: "history"
- Condition: "pregnant"
- Observation: "breastfeeding"